Clinical trial exclusion criterion:
Patients with dexterity insufficiency of hands

Annotated entities:
- Condition: "dexterity insufficiency of hands"